Negative HIV serology during screening period.

The above is a clinical trial inclusion criterion. Annotated with entity spans:
[Value: Negative] [Measurement: HIV serology] [Temporal: during screening period].